Clinical trial exclusion criterion:
4. Active brain metastases. Patients with treated brain metastases are eligible, if (1) radiation therapy was completed at least 2 weeks prior to study entry; (2) follow-up scan shows no disease progression; and (3) patient does not require steroids.

Annotated entities:
- Condition: "brain metastases"
- Temporal: "Active"
- Condition: "brain metastases"
- Procedure: "treated"
- Qualifier: "treated"
- Negation: "are eligible"
- Grammar_Error: "are eligible"
- Procedure: "radiation therapy"
- Temporal: "at least 2 weeks prior to study entry"
- Reference_point: "study entry"
- Condition: "disease progression"
- Procedure: "follow-up scan"
- Negation: "no"
- Drug: "steroids"
- Negation: "not"
- Mood: "require"